Clinical trial exclusion criterion:
The patients are pregnant or lactational, or they refuse to practice contraception during the whole trial.

Annotated entities:
- Condition: "pregnant"
- Condition: "lactational"
- Procedure: "contraception"
- Negation: "refuse to practice"
- Temporal: "during the whole trial"